Clinical trial exclusion criteria:
Contraindication for IR-MPH use
Current stimulant treatment
Evidence of a clinically significant neurological disease that might affect cognition (e.g., delirium, dementia, epilepsy, head trauma, and multiple sclerosis)
Current or past history of psychosis
Estimated intelligence quotient score lower than 70

Annotated entities:
- Condition: "Contraindication"
- Drug: "IR-MPH"
- Temporal: "Current"
- Procedure: "stimulant treatment"
- Mood: "Evidence"
- Qualifier: "clinically significant"
- Condition: "neurological disease"
- Qualifier: "might affect cognition"
- Condition: "delirium"
- Condition: "dementia"
- Condition: "epilepsy"
- Condition: "head trauma"
- Condition: "multiple sclerosis"
- Temporal: "Current"
- Temporal: "past"
- Temporal: "history"
- Condition: "psychosis"
- Measurement: "Estimated intelligence quotient score"
- Value: "lower than 70"